Stroke or transient ischemic attack

The above is a clinical trial exclusion criterion. Annotated with entity spans:
[Condition: Stroke] or [Condition: transient ischemic attack]